Clinical trial exclusion criterion:
Diagnosis of a sleep disorder other than insomnia including PSG findings of apnea/hypopnea or periodic limb movement indices > 10/hour;

Entity relations:
- Has_value("periodic limb movement indices", "> 10/hour")
- AND("PSG", "apnea")
- Subsumes("sleep disorder", "PSG")
- Has_negation("insomnia", "other")
- OR("apnea", "hypopnea")
- OR("PSG", "periodic limb movement indices")